有關痙攣雙下肢型（spastic diplegia）腦性麻痺（cerebral palsy）之敘述，下列何者錯誤？
A. 大部分病童能走路
B. 通常較晚才開始走路
C. 若到7歲還不能走路，則日後能走路的機會變少
D. 智能發展遲緩常會影響走路的能力

正確答案：D. 智能發展遲緩常會影響走路的能力